El hidruro de litio y aluminio reacciona con los ácidos carboxílicos para dar:
1. Ésteres.
2. Cetonas.
3. Alcoholes terciarios.
4. Alcoholes secundarios.
5. Alcoholes primarios.

Respuesta correcta: 5. Alcoholes primarios.